有關痛風（gout）的敘述，下列何者正確？
A. 在急性發作時，血清中尿酸（uric acid）值一定增高
B. 急性發作時，使用非類固醇消炎藥（NSAIDs）或秋水仙素（colchicine）治療
C. 長期高尿酸血症的患者，常可見到半月軟骨（meniscus）發生軟骨鈣質沉	病（chondrocalcinosis）
D. 偏光顯微鏡（polarized light microscope）檢查關節液，可見到陽性雙折射（positively birefringent）特性的針狀結晶體

正確答案：B. 急性發作時，使用非類固醇消炎藥（NSAIDs）或秋水仙素（colchicine）治療